Clinical trial inclusion criteria:
Female patients older than 18 years.
Patients who agree to participate in the study.
Those that meet the ACR 1990 and 2010 criteria for Fibromyalgia.
No previous use of vitamin D.
Patients diagnosed with primary or secondary fibromyalgia.

Annotated entities:
- Person: "Female"
- Value: "older than 18 years"
- Person: "years"
- Informed_consent: "Patients who agree to participate in the study."
- Qualifier: "ACR 1990"
- Qualifier: "ACR 2010"
- Condition: "Fibromyalgia"
- Negation: "No"
- Temporal: "previous"
- Value: "vitamin D"
- Condition: "fibromyalgia"
- Qualifier: "secondary"
- Qualifier: "primary"